Atrial fibrillation and not on oral anticoagulation (OAC) therapy but eligible

The above is a clinical trial inclusion criterion. Annotated with entity spans:
[Condition: Atrial fibrillation] and [Measurement: not] on [Procedure: oral anticoagulation (OAC) therapy] [Non-representable: but eligible]